Clinical trial exclusion criterion:
Subjects who are immediate candidates for an ICD

Annotated entities:
- Temporal: "immediate"
- Mood: "candidates for"
- Procedure: "ICD"